下列那 2 種免疫球蛋白（immunoglobulin），可以提供新生兒對抗病原菌保護力？
A. IgA 與 IgD
B. IgD 與 IgE
C. IgE 與 IgG
D. IgG 與 IgA

正確答案：D. IgG 與 IgA